Clinical trial exclusion criterion:
Hypertension (BP>140/90 mmHg);

Annotated entities:
- Condition: "Hypertension"
- Measurement: "BP"
- Value: ">140/90 mmHg"